History of epilepsy or convulsions due to any reason.

The above is a clinical trial exclusion criterion. Annotated with entity spans:
History of [Condition: epilepsy] or [Condition: convulsions] due to any reason.